For colorectal cancer patients in the expanded cohorts, prior treatment with more than 2 systemic chemotherapy regimens in the metastatic setting

The above is a clinical trial exclusion criterion. Annotated with entity spans:
For [Condition: colorectal cancer] patients in the expanded cohorts, [Temporal: prior] [Procedure: treatment] with [Value: more than 2] [Procedure: systemic chemotherapy regimens] in the [Qualifier: metastatic] setting